有關達托黴素（Daptomycin）之敘述，下列何者錯誤？
A. 作用在細胞膜上
B. 屬脂胜肽（lipopeptides）藥物
C. 對多重抗藥性之嗜麥芽窄食單胞菌 (Stenotrophomonas maltophilia）有效
D. 可以治療抗萬古黴素（Vancomycin）之金黃色葡萄球菌（Staphylococcus aureus）所引起的疾病

正確答案：C. 對多重抗藥性之嗜麥芽窄食單胞菌 (Stenotrophomonas maltophilia）有效